What is etarfolatide used for?

Etarfolatide in the form of 99mTc-etarfolatide is used as a companion imaging agent